Clinical trial inclusion criterion:
3. Subject's lesion(s) is (are) amenable to stent treatment with currently available FDA-approved bare metal or drug eluting stents.

Entity relations:
- AND("amenable to stent treatment", "bare metal stents")
- OR("bare metal stents", "drug eluting stents")